Clinical trial inclusion criteria:
Acute Myocardial Infarction Undergoing Primary percutaneous coronary intervention.

Annotated entities:
- Condition: "Acute Myocardial Infarction"
- Procedure: "Primary percutaneous coronary intervention"